Describe what is athelia syndrome?

Athelia is a very rare entity that is defined by the absence of the nipple-areola complex.